一位35歲男性，初次被診斷為高血壓，血壓為140/96 mmHg，脈搏為70拍/分，病人並無任何症狀，過去亦無特殊病史，理學檢查除血壓高之外，並無特殊異常發現。下列何者不是初步評估此病人所需安排之檢查？
A. 尿液常規檢查
B. 鉀離子
C. 甲狀腺刺激素
D. 空腹血糖

正確答案：C. 甲狀腺刺激素